Clinical trial exclusion criterion:
acute cholecystitis within two months

Annotated entities:
- Condition: "acute cholecystitis"
- Temporal: "within two months"